Clinical trial inclusion criterion:
Prevalent NHHD patients who have received >1 year dialysis with unfractionated heparin as anticoagulant

Annotated entities:
- Condition: "NHHD"
- Temporal: ">1 year"
- Procedure: "dialysis"
- Drug: "unfractionated heparin"
- Drug: "anticoagulant"